6. History of evidence of clinically significant hepatic, cardiac, pulmonary, endocrine, immunological, gastrointestinal, hematological, vascular or collagen disease

The above is a clinical trial exclusion criterion. Annotated with entity spans:
[Parsing_Error: 6.] [Temporal: History] of evidence of [Subjective_judgement: clinically significant] [Condition: hepatic], [Condition: cardiac], [Condition: pulmonary], [Condition: endocrine], [Condition: immunological], [Condition: gastrointestinal], [Condition: hematological], [Condition: vascular] or [Condition: collagen disease]